下列有關神經纖維瘤症（neurofibromatosis）的敘述，何者錯誤？
A. 可分兩型，type 1 又稱 von Recklinghausen's disease
B. type 1 在皮膚上可見色素斑和神經纖維瘤（neurofibroma）
C. type 2 的患者，顱內常併多發的腦膜瘤（multicentric meningioma）
D. type 1 常有雙側聽神經瘤（acoustic schwannoma）

正確答案：D. type 1 常有雙側聽神經瘤（acoustic schwannoma）